一位 25 歲女士，生產史為 G3P2，目前懷孕 7 週，主訴陰道有出血現象，於是醫師安排陰道超音波檢查，確定在子宮內有一胚囊同時發現胎兒心臟跳動的現象，但是左側子宮附屬組織有一 3 公分的水囊，請問下列敘述何者最佳？
A. 此病患可能同時有子宮內懷孕及子宮外孕
B. 此病患應該被告知即將無法繼續懷孕
C. 此水囊應該及早手術拿掉
D. 妊娠第一期（first trimester）陰道出血並非少見

正確答案：D. 妊娠第一期（first trimester）陰道出血並非少見